Clinical trial exclusion criterion:
The existence of intra-cardiac thrombus on trans-esophageal echocardiography

Annotated entities:
- Condition: "intra-cardiac thrombus"
- Procedure: "trans-esophageal echocardiography"